Clinical trial exclusion criterion:
Lifetime history of 5 or more migraine or probable migraine headaches pre-dating mTBI

Annotated entities:
- Temporal: "Lifetime history"
- Multiplier: "5 or more"
- Condition: "migraine"
- Qualifier: "probable"
- Condition: "migraine"
- Temporal: "pre-dating mTBI"
- Procedure: "mTBI"
- Reference_point: "mTBI"